Clinical trial exclusion criterion:
Ibuprofen Allergy/interlerance

Annotated entities:
- Drug: "Ibuprofen"
- Condition: "Allergy"
- Condition: "interlerance"